下列何種基因和胰臟癌的發生較無關聯？
A. Her2/neu
B. K-ras
C. APC
D. p53

正確答案：C. APC